Age = 19 and = 70 years;

The above is a clinical trial inclusion criterion. Annotated with entity spans:
[Person: Age] [Value: = 19 and = 70 years];